Clinical trial exclusion criterion:
Active bleeding or high bleeding risk (severe liver failure, active peptic ulcer, creatinine clearance < 30 mL/min, platelets count < 100.000 mm3);

Entity relations:
- Has_qualifier("bleeding", "Active")
- Has_qualifier("liver failure", "severe")
- Has_qualifier("peptic ulcer", "active")
- Has_value("creatinine clearance", "< 30 mL/min")
- Has_value("platelets count", "< 100.000 mm3")
- OR("bleeding", "creatinine clearance", "peptic ulcer", "liver failure", "high bleeding risk", "platelets count")